Clinical trial exclusion criterion:
History of Stroke in the last 3 months;

Annotated entities:
- Temporal: "History of"
- Condition: "Stroke"
- Temporal: "in the last 3 months"